Clinical trial exclusion criterion:
History of myocardial infarction, unstable angina pectoris, coronary bypass surgery, or any percutaneous coronary intervention (PCI) during the 6 months prior to Visit 1

Entity relations:
- AND("History", "myocardial infarction")
- Has_temporal("myocardial infarction", "during the 6 months prior")
- OR("myocardial infarction", "unstable angina pectoris", "coronary bypass surgery", "percutaneous coronary intervention (PCI)")